肝細胞癌（Hepatocellular carcinoma）在流行病學上與下列何者無關？
A. HBV infection
B. HAV infection
C. Cirrhosis
D. Aflatoxin

正確答案：B. HAV infection